Clinical trial exclusion criterion:
History of intracranial hypertension

Entity relations:
- Has_temporal("intracranial hypertension", "History")